El dengue es una enfermedad infecciosa endémica en determinadas comunidades. Cuando el 38% de la población de una comunidad presenta dicha enfermedad, se habla de :
1. Holoendemia.
2. Hiperendemia.
3. Mesoendemia.
4. Hipoendemia.
5. Pandemia.

Respuesta correcta: 3. Mesoendemia.